What is AZD0530 an inhibitor of?

AZD0530 is a highly selective, dual Src/Abl kinase inhibitor.